Clinical trial exclusion criterion:
Known bigemini/trigeminy

Entity relations:
- OR("bigemini", "trigeminy")